Able to take oral medication

The above is a clinical trial inclusion criterion. Annotated with entity spans:
[Observation: Able to take oral medication]